Clinical trial exclusion criterion:
Subjects with hemoglobin SC or SB+ thalassemia

Annotated entities:
- Condition: "hemoglobin SC"
- Condition: "SB+ thalassemia"